Clinical trial inclusion criterion:
Patient has received an organ transplant or is on a waiting list for an organ transplant

Entity relations:
- Has_mood("organ transplant", "is on a waiting list")
- OR("organ transplant", "organ transplant")